1 . 對 於 c a l c i n e u r i n   i n h i b i t o r s 的 敘 述 ， 下 列 何 者 正 確 ？
A. tacrolimus（FK-506）和sirolimus都屬於calcineurin inhibitors，都作用在FK binding protein之上
B. cyclosporine會有禿頭（alopecia）和牙齦增生（gingival hypertrophy）的副作用
C. FK-506所引起的糖尿病有時候會在停藥之後恢復 A	8
D. FK-506和cyclosporine都屬於腎臟移植術後用藥，不會有腎毒性的副作用

正確答案：C. FK-506所引起的糖尿病有時候會在停藥之後恢復 A	8